On treatment with a P2Y12 receptor antagonist (ticlopidine, clopidogrel, prasugrel, ticagrelor) in the prior 10 days

The above is a clinical trial exclusion criterion. Annotated with entity spans:
On treatment with a [Drug: P2Y12 receptor antagonist] ([Drug: ticlopidine], [Drug: clopidogrel], [Drug: prasugrel], [Drug: ticagrelor]) in the [Temporal: prior 10 days]